Patients with a primary diagnosis of severe acute pancreatitis, without reference to a Ranson score [Ranson 1974]). However, patients with mild or moderate pancreatitis are not excluded;

The above is a clinical trial exclusion criterion. Annotated with entity spans:
Patients with a primary diagnosis of [Qualifier: severe] [Condition: acute pancreatitis], [Negation: without] reference to a [Measurement: Ranson score] [Ranson 1974]). However, patients with [Qualifier: mild] or [Qualifier: moderate] [Condition: pancreatitis] are [Negation: not] excluded;